Clinical trial inclusion criterion:
aged = 8 months

Annotated entities:
- Person: "aged"
- Value: "= 8 months"